下列何者最常被用來評估臨床疼痛？
A. numeric rating scale
B. visual analog scale（VAS）
C. verbal rating scale
D. dermatomal pain drawing

正確答案：B. visual analog scale（VAS）